Clinical trial exclusion criterion:
Symptomatic hypotension.

Entity relations:
- Has_qualifier("hypotension", "Symptomatic")